Clinical trial exclusion criterion:
Positive serological tests such as AIDS, hepatitis B virus, hepatitis C virus and syphilis （antigen or antibody）.

Annotated entities:
- Condition: "AIDS"
- Condition: "hepatitis B virus"
- Condition: "hepatitis C virus"
- Condition: "syphilis"
- Grammar_Error: "and"